Angina

The above is a clinical trial exclusion criterion. Annotated with entity spans:
[Condition: Angina]